Clinical trial exclusion criterion:
Need for dual organ transplant

Annotated entities:
- Procedure: "dual organ transplant"
- Mood: "Need for"